life expectancy of more than 3 months

The above is a clinical trial inclusion criterion. Annotated with entity spans:
[Observation: life expectancy] of [Value: more than 3 months]